Patients with a history of epilepsy

The above is a clinical trial exclusion criterion. Annotated with entity spans:
Patients with a history of [Condition: epilepsy]